Other significant medical illness that might interfere with this study: significant pulmonary dysfunction in the previous 6 months, malignancy other than skin basocellular carcinoma in previous 5 years, immunodeficiency syndromes (e.g. HIV positivity, auto-immune diseases, organ transplants other than cornea and hair transplant)

The above is a clinical trial exclusion criterion. Annotated with entity spans:
Other [Qualifier: significant] [Condition: medical illness] that might interfere with this study: [Qualifier: significant] [Condition: pulmonary dysfunction] [Temporal: in the previous 6 months], [Condition: malignancy] [Negation: other than] [Condition: skin basocellular carcinoma] [Temporal: in previous 5 years], [Condition: immunodeficiency syndromes] (e.g. [Condition: HIV positivity], [Condition: auto-immune diseases], [Procedure: organ transplants] [Negation: other than] [Procedure: cornea] and [Procedure: hair transplant])